Clinical trial inclusion criterion:
7. Patients with idiopathic sensory neuropathy must have had pain of at least 3 months' duration

Annotated entities:
- Condition: "idiopathic sensory neuropathy"
- Condition: "pain"
- Temporal: "at least 3 months' duration"